Clinical trial exclusion criterion:
Other severe concurrent illness (e.g. active infection, malignancy).

Entity relations:
- Has_qualifier("illness", "concurrent")
- Has_qualifier("illness", "severe")
- Subsumes("illness", "active infection")
- OR("active infection", "malignancy")